一位嬰兒出生時，懷孕週數 35 週，出生體重 1950 gm，有腦室周圍鈣化、雙側神經性聽力障礙、肝脾腫大、黃疸，尿液培養出某種病原，則該病原最可能是：
A. Herpes simplex virus
B. Toxoplasma gondii
C. cytomegalovirus
D. rubella virus

正確答案：C. cytomegalovirus